Clinical trial inclusion criterion:
via transfemoral access

Annotated entities:
- Procedure: "transfemoral access"